Clinical trial exclusion criterion:
History of thrombocytopenia induced by heparin

Annotated entities:
- Condition: "thrombocytopenia"
- Drug: "heparin"